28歲孕婦，G1P0，無家族病史，目前懷孕12週，經與婦產科醫師諮詢後，決定接受第一孕期母血唐氏症篩檢 （first-trimester  maternal serum Down screen），因而接受抽血檢	及超音波檢查。下列何者不是第一孕期母血唐氏症篩檢所包含之項目？
A. Human chorionic gonadotropin（hCG）or free β-hCG（free β-subunit hCG）
B. Nuchal translucency（NT）
C. Unconjugated estriol（uE3）
D. Pregnancy-associated plasma protein-A（PAPP-A）

正確答案：C. Unconjugated estriol（uE3）